What does PCAT6 stand for?

PCAT6 stands for prostate cancer-associated transcript 6.